一位1歲的小孩這2天有感冒的症狀，食慾減退。早上起床時母親發現他意識不清，呼吸困難。送到醫院後抽血發現血糖值只有10 mg/dL，而且乳酸非常高。醫師同時發現病童的肝臟很大，在肋骨下緣8公分。最可能的診斷為下列何者？
A. 高胰島素血症
B. 肝醣儲積症Ia型
C. 有機酸血症
D. 急性肝炎

正確答案：B. 肝醣儲積症Ia型